Clinical trial inclusion criterion:
Temperature 35-37.9°C (95-100.3°F)

Entity relations:
- Subsumes("35-37.9°C", "95-100.3°F")
- Has_value("Temperature", "35-37.9°C")